Describe ReactomeGSA

ReactiveomeGSA is a novel R Bioconductor package for comparative pathway analyses of multi-omics datasets. Data from different species is automatically mapped to a common pathway space. Public data from ExpressionAtlas and Single Cell ExpressionAt Atlas can be directly integrated in the analysis. ReactomeGsa greatly reduces the technical barrier for multi-seq, cross-species, comparative pathway analysis.